Clinical trial inclusion criterion:
Greater than or equal to 3 months of pain after onset of symptoms that has failed conservative treatments

Annotated entities:
- Condition: "pain"
- Temporal: "Greater than or equal to 3 months"
- Temporal: "after onset of symptoms"
- Reference_point: "onset of symptoms"
- Mood: "failed"
- Procedure: "conservative treatments"